Pre-operative hemoglobin >8 g/dl

The above is a clinical trial inclusion criterion. Annotated with entity spans:
[Temporal: Pre-operative] [Measurement: hemoglobin] [Value: >8 g/dl]